Clinical trial inclusion criterion:
ASA physical status 1-3

Annotated entities:
- Measurement: "ASA physical status"
- Value: "1-3"